Clinical trial exclusion criterion:
Concomitant drug therapy known to cause significant enzyme induction or inhibition of CYP 3A4.

Entity relations:
- Has_temporal("drug therapy", "Concomitant")
- Has_context("drug therapy", "enzyme inhibition of CYP 3A4")
- OR("enzyme inhibition of CYP 3A4", "enzyme induction of CYP 3A4")